Two well-characterized mutations in the cystic fibrosis transmembrane conductance regulator (CFTR) gene

The above is a clinical trial inclusion criterion. Annotated with entity spans:
[Multiplier: Two] well-characterized [Condition: mutations] in the [Condition: cystic fibrosis transmembrane conductance regulator] ([Condition: CFTR]) gene